Clinical trial exclusion criterion:
Supine systolic blood pressure <85 mm Hg or >200 mm Hg at screening.

Entity relations:
- Has_qualifier("systolic blood pressure", "Supine")
- Has_value("systolic blood pressure", "<85 mm Hg")
- OR("<85 mm Hg", ">200 mm Hg")